右側乳房淋巴系統，通常不會直接匯入：
A. 鎖骨下淋巴幹（subclavian trunk）
B. 胸管（thoracic duct）
C. 腋淋巴結（axillary lymph nodes）
D. 胸骨旁淋巴結（parasternal lymph nodes）

正確答案：B. 胸管（thoracic duct）